嚴重多重外傷病患經積極治療及手術後，如能夠存活超過一星期，最常見之晚期死亡原因為何？
A. 嚴重頭部外傷
B. 多重器官衰竭
C. 出血性休克
D. 急性腎衰竭

正確答案：B. 多重器官衰竭